Clinical trial exclusion criterion:
Pregnant women who breast-feed or test positive for pregnancy

Annotated entities:
- Condition: "Pregnant"
- Person: "women"
- Condition: "breast-feed"
- Measurement: "test for pregnancy"
- Value: "positive"